List invertebrates where ultraconserved elements have been identified.

Ultraconserved elements have been identified in the following genomes of invertebrates: tunicates, diptera, worm and yeast.